一位成人因頭部外傷致死，影像檢查發現硬腦膜與頭蓋骨之間有血腫，這情形最常發生於下列何狀況？
A. 顳骨骨折
B. 上矢狀竇撕裂
C. 橋連靜脈撕裂
D. 動脈瘤破裂

正確答案：A. 顳骨骨折